Clinical trial inclusion criterion:
ADHD is diagnosed according to Diagnostic and Statistical Manual of Mental Disorders, fifth edition (DSM-5 criteria).

Annotated entities:
- Condition: "ADHD"
- Qualifier: "DSM-5"